eye diseases or pathologies that prevent clear ophthalmoscopy and evaluation of study parameters, thus not allowing study participation according to the investigator´s judgment, such as (but not only) vitreous hemorrhage, mature cataract, macular pathologies other than diabetic maculopathy

The above is a clinical trial exclusion criterion. Annotated with entity spans:
eye diseases or pathologies that [Negation: prevent] clear [Procedure: ophthalmoscopy] and evaluation of study parameters, thus not allowing study participation according to the investigator´s judgment, such as (but not only) [Condition: vitreous hemorrhage], [Condition: mature cataract], [Condition: macular pathologies] [Negation: other] than [Condition: diabetic maculopathy]